小新得到喉嚨感染，醫師為他做了喉頭細菌培養發現鏈狀排列的格蘭氏陽性菌。小新三週以後出現心臟衰竭而住院。醫師發現他有新出現的心雜音，診斷為風濕性心臟病。關於此病患的疾病，下列敘述，何者正確？
A. 他的心衰竭主要是腎炎引發的高血壓所引起
B. 細菌在心臟瓣膜上繁殖而引起疾病
C. 他可能也會發生關節腫痛的症狀
D. 病患的免疫系統對細菌產生免疫容忍而無法清除細菌

正確答案：C. 他可能也會發生關節腫痛的症狀